Clinical trial exclusion criterion:
Treatment with levothyroxine must not be initiated in patients with acute myocardial infarction, acute myocarditis, or acute pancarditis.

Annotated entities:
- Drug: "levothyroxine"
- Condition: "acute myocardial infarction"
- Negation: "not be initiated"
- Procedure: "Treatment"
- Condition: "acute myocarditis"
- Condition: "acute pancarditis"